Emergent surgery

The above is a clinical trial exclusion criterion. Annotated with entity spans:
[Procedure: Emergent surgery]